Be at least 18 years of age and able to give informed consent.

The above is a clinical trial inclusion criterion. Annotated with entity spans:
Be [Value: at least 18 years] of [Person: age] and [Non-query-able: able to give informed consent].